有關rectosacral fascia的敘述，下列何者錯誤？
A. 它在S4位置連接presacral fascia和直腸的fascia propria
B. 若是手術過程不慎穿破這個landmark，將會往後進入presacral fascia引起venous plexus受傷大流血
C. 若是手術分離組織過程沒有沿	rectosacral fascia，往前會破壞fascia propria，造成癌細胞局部轉移的風險
D. rectosacral fascia又稱做Denonvilliers fascia

正確答案：D. rectosacral fascia又稱做Denonvilliers fascia